Clinical trial inclusion criteria:
1. Patients with stable (Canadian Cardiovascular Society 1, 2, 3 or 4) or unstable (Braunwald class IB, IC, IIB, IIC, IIIB, IIIC) angina pectoris and ischemia, or patients with atypical chest pain or even those who are asymptomatic provided they have documented myocardial ischaemia (e.g. treadmill exercise test, radionuclide scintigraphy, stress echocardiography, Holter tape);
2. Patients who are eligible for coronary revascularization (angioplasty or CABG);
3. At least 2 lesions (located in different vessels and in different territories) potentially amenable to stent implantation;
4. de novo native vessels;
5. Multivessel disease with at least one significant stenosis in LAD and with treatment of the lesion in another major epicardial coronary artery. A two-vessel disease or a three-vessel disease may be viewed as a combination of a side branch and a main epicardial vessel provided they supply different territories; left anterior descending, left circumflex and right coronary artery);
6. Total occluded vessels. One total occluded major epicardial vessel or side branch can be included and targeted as long as one other major vessel has a significant stenosis amenable for SA, provided the age of occlusion is less than one month e.g. recent instability, infarction with ECG changes in the area subtended by the occluded vessel. Patients with total occluded vessels of unknown duration or existing longer than one month and a reference over 1.50 mm should not be included, not even as a third or fourth vessel to be dilated;
7. Significant stenosis has been defined as a stenosis of more than 50% in luminal diameter (in at least one view, on visual interpretation or preferably by QCA);
8. Left ventricular ejection fraction should be at least 30%.

Annotated entities:
- Measurement: "Canadian Cardiovascular Society"
- Value: "1, 2, 3 or 4"
- Qualifier: "stable"
- Qualifier: "unstable"
- Measurement: "Braunwald class"
- Value: "IB"
- Condition: "angina pectoris"
- Condition: "ischemia"
- Condition: "atypical chest pain"
- Condition: "asymptomatic"
- Condition: "myocardial ischaemia"
- Observation: "documented"
- Procedure: "treadmill exercise test"
- Procedure: "radionuclide scintigraphy"
- Procedure: "stress echocardiography"
- Procedure: "Holter tape"
- Value: "IC"
- Value: "IIB"
- Value: "IIC"
- Value: "IIIB"
- Value: "IIIC"
- Procedure: "coronary revascularization"
- Mood: "eligible for"
- Procedure: "angioplasty"
- Procedure: "CABG"
- Value: "At least 2"
- Condition: "lesions"
- Qualifier: "located in different vessels"
- Qualifier: "located in different territories"
- Procedure: "stent implantation"
- Observation: "potentially amenable"
- Qualifier: "de novo"
- Condition: "native vessels"
- Condition: "Multivessel disease"
- Value: "at least one"
- Condition: "significant stenosis in LAD"
- Procedure: "treatment of the lesion"
- Qualifier: "in another major epicardial coronary artery"
- Non-representable: "A two-vessel disease or a three-vessel disease may be viewed as a combination of a side branch and a main epicardial vessel provided they supply different territories; left anterior descending, left circumflex and right coronary artery);"
- Condition: "total occluded vessels"
- Temporal: "unknown duration"
- Temporal: "longer than one month"
- Value: "over 1.50 mm"
- Measurement: "reference"
- Condition: "Total occluded vessels"
- Multiplier: "One"
- Condition: "total occluded major epicardial vessel"
- Condition: "total occluded side branch"
- Measurement: "stenosis"
- Value: "more than 50% in luminal diameter"
- Condition: "Significant stenosis"
- Measurement: "Left ventricular ejection fraction"
- Value: "at least 30%"